Clinical trial inclusion criterion:
Have stable renal function for one month (30 days) prior to enrollment

Annotated entities:
- Measurement: "renal function"
- Value: "stable"
- Temporal: "one month (30 days) prior to enrollment"
- Reference_point: "enrollment"